Las creencias y los valores, según la psicología de la personalidad:
1. Una vez establecidos, no experimentan cambios durante el resto de la vida del individuo.
2. Dirigen a la persona hacia la transcendencia, según la propuesta motivacional de Maslow.
3. Predisponen a la persona a preferir unos modos de comportamiento frente a otros.
4. Impulsan a las personas hacia la defensa de los derechos humanos.
5. Fomentan el desarrollo del grupo frente al desarrollo individual.

Respuesta correcta: 3. Predisponen a la persona a preferir unos modos de comportamiento frente a otros.